Hyperglycemia (Serum glucose > 200 mg/dl)

The above is a clinical trial inclusion criterion. Annotated with entity spans:
[Condition: Hyperglycemia] ([Measurement: Serum glucose] [Value: > 200 mg/dl])